Clinical trial inclusion criterion:
patients were 18 years old or more,

Entity relations:
- Has_value("old", "18 years old or more")